¿Cuáles de los siguientes estadísticos NO es afectado por datos atípicos (outliers) en una muestra?:
1. Media muestral.
2. Desviación estándar.
3. Varianza.
4. Rango intercuartílico.
5. Rango.

Respuesta correcta: 4. Rango intercuartílico.